Clinical trial exclusion criterion:
Any previous treatments for active CSC;

Annotated entities:
- Qualifier: "active"
- Condition: "CSC"
- Procedure: "treatments"
- Temporal: "previous"